Clinical trial exclusion criterion:
Patients with medical comorbidities preventing them from definitive surgical therapy.

Annotated entities:
- Condition: "medical comorbidities"
- Procedure: "definitive surgical therapy"
- Mood: "preventing them from"